Clinical trial inclusion criteria:
Patient with "de novo" heart Failure and LVEF <= 40% admitted in hospital, without contraindications for BB prescription with cardiologist up-titration prescription and without having achieved BB target dose previous discharge and signing informed consent.

Annotated entities:
- Qualifier: "de novo"
- Condition: "heart Failure"
- Measurement: "LVEF"
- Value: "<= 40%"
- Procedure: "admitted"
- Visit: "hospital"
- Negation: "without"
- Condition: "contraindications"
- Drug: "BB"